A glomerular filtration rate of 60 cc per minute or less.

The above is a clinical trial exclusion criterion. Annotated with entity spans:
A [Measurement: glomerular filtration rate] of [Value: 60 cc per minute or less].